Clinical trial exclusion criterion:
Serious medical illness

Annotated entities:
- Condition: "medical illness"
- Qualifier: "Serious"
- Undefined_semantics: "medical illness"
- Subjective_judgement: "Serious"
- Undefined_semantics: "Serious"